Clinical trial inclusion criterion:
English or Spanish literate

Annotated entities:
- Non-query-able: "English or Spanish literate"